2. Screening tools: Medical Assessment, Medical History and Physical Examination. Medical assessments include: Vital Signs, EKG, oral HIV test, height/weight measurements, urinalysis and blood sample. Tests on the blood sample include CBC, complete metabolic profile, TSH, ESR, STS and HIV (if needed to confirm a positive salivary test for HIV). The following individual laboratory results will independently disqualify individuals: Cholesterol >250 mg/dl, Hemoglobin < 10.5 g/dl, WBC < 2400/microl, LFTs > 3Xnormal, HCG positive, Casual serum glucose > 200 mg/dl, Urine protein > 1+. The MAI will retain discretion to exclude at less extreme values, depending on the clinical presentation. (Serum glucose over 140 mg/dl will be followed up with a fasting serum glucose assessment. Those with fasting glucose below 100 mg/dl may be considered for the protocol. Others will be rejected and referred for work-up.) MAI will make the final judgment on any questionable lab results.

The above is a clinical trial inclusion criterion. Annotated with entity spans:
[Parsing_Error: 2.] Screening tools: [Procedure: Medical Assessment], [Temporal: Medical History] and [Procedure: Physical Examination]. Medical assessments include: [Measurement: Vital Signs], [Procedure: EKG], [Procedure: oral HIV test], [Measurement: height]/[Measurement: weight measurement]s, [Procedure: urinalysis] and [Procedure: blood sample]. Tests on the blood sample include [Procedure: CBC], [Procedure: complete metabolic profile], [Procedure: TSH], [Procedure: ESR], [Procedure: STS] and [Procedure: HIV] (if needed to confirm a [Value: positive] [Measurement: salivary test for HIV]). The following individual laboratory results will independently [Grammar_Error: disqualify] individuals: [Measurement: Cholesterol] [Value: >250 mg/dl], [Measurement: Hemoglobin] [Value: < 10.5 g/dl], [Measurement: WBC] [Value: < 2400/microl], [Measurement: LFTs] [Value: > 3Xnormal], [Measurement: HCG] [Value: positive], Casual [Measurement: serum glucose] [Value: > 200 mg/dl], [Measurement: Urine protein] [Value: > 1+]. [Not_a_criteria: The MAI will retain discretion to exclude at less extreme values, depending on the clinical presentation.] ([Measurement: Serum glucose] [Value: over 140 mg/dl] will be followed up with a [Procedure: fasting serum glucose assessment]. Those with fasting glucose below 100 mg/dl may be considered for the protocol. Others will be rejected and referred for work-up.) MAI will make the final judgment on any questionable lab results.